Clinical trial inclusion criterion:
age > 17 and < 60 years;

Annotated entities:
- Person: "age"
- Value: "> 17 and < 60 years"